Clinical trial inclusion criterion:
staging IIB

Annotated entities:
- Qualifier: "staging IIB"